Orthopedic and neurological diseases that may preclude the achievement of the cardiopulmonary test and Cardiac Rehabilitation exercises;

The above is a clinical trial exclusion criterion. Annotated with entity spans:
[Condition: Orthopedic] and [Condition: neurological diseases] that may [Qualifier: preclude the achievement of the cardiopulmonary test and Cardiac Rehabilitation exercises];